目前所知人類基因之中，與自體免疫疾病有顯著相關性者，是人類白血球抗原（Human Leukocyte Antigen, HLA）基因。某些人類白血球抗原（HLA）基因在某自體免疫疾病患者中的存在有較為增高現象，是為有較高的「相較性的危險值」（relative risk）引起自體免疫致病性。下列那一項基因和疾病關係的敘述是正確的？
A. DR3 對於僵直性脊椎炎（Ankylosing spondylitis）
B. DR4 對於僵直性脊椎炎
C. DR3/DR4 對於第一型糖尿病（type I diabetes mellitus）
D. DR5 對於僵直性脊椎炎

正確答案：C. DR3/DR4 對於第一型糖尿病（type I diabetes mellitus）